Clinical trial exclusion criteria:
A1C >7.0%
2hr glucose during OGTT >200 mg/dL
Total cholesterol >280 mg/dL
Previous diabetic history, coronary artery disease
Allergy to rosuvastatin or parvastatin
Baseline ALT more than 3 times UNL
Serum Cr > 2.0 mg/dL
Pregnancy, breast feeding or plan to be pregnant woman.

Annotated entities:
- Measurement: "A1C"
- Value: ">7.0%"
- Measurement: "2hr glucose during OGTT"
- Value: ">200 mg/dL"
- Measurement: "Total cholesterol"
- Value: ">280 mg/dL"
- Condition: "diabetic"
- Temporal: "history"
- Temporal: "Previous"
- Condition: "coronary artery disease"
- Condition: "Allergy"
- Drug: "rosuvastatin"
- Drug: "parvastatin"
- Temporal: "Baseline"
- Measurement: "ALT"
- Value: "more than 3 times UNL"
- Measurement: "Serum Cr"
- Value: "> 2.0 mg/dL"
- Condition: "Pregnancy"
- Observation: "breast feeding"
- Mood: "plan to be"
- Condition: "pregnant"
- Person: "woman"